El estímulo más potente para la liberación de vasopresina o ADH es:
1. Un aumento de osmolaridad plasmática.
2. El aumento de la presión arterial.
3. El aumento de la volemia.
4. La saciedad.

Respuesta correcta: 1. Un aumento de osmolaridad plasmática.